一位 81 歲男性，因喪失意識被送入急診，到院時無生命跡象。你立刻進行心肺復甦術，發現心電圖上顯示為心搏停止（asystole），準備開始給藥以及插管。以下處置敘述中，何者最適當？
A. 可給與 epinephrine 1 mg，每 3-5 分鐘給與 1 次
B. 可使用 vasopressin 40 U 代替 epinephrine，最多可使用至 3 次
C. 建議使用經皮心律調節器（transcutaneous pacemaker）
D. 須先插管成功後才可給藥，否則效果不好

正確答案：A. 可給與 epinephrine 1 mg，每 3-5 分鐘給與 1 次